No consent

The above is a clinical trial exclusion criterion. Annotated with entity spans:
[Informed_consent: No consent]